Clinical trial exclusion criterion:
Renal biopsy showing cellular or fibrocellular crescent in more than 25% of glomeruli.

Annotated entities:
- Procedure: "Renal biopsy"
- Condition: "fibrocellular crescent"
- Condition: "cellular crescent"
- Multiplier: "more than 25% of glomeruli"